Clinical trial exclusion criterion:
Pulmonary nodule requiring surgery

Entity relations:
- causal("surgery", "Pulmonary nodule")